Subjects have following investigations within 1 month prior to enrolment.

The above is a clinical trial inclusion criterion. Annotated with entity spans:
[Non-representable: Subjects have following investigations within 1 month prior to enrolment.]